En relación a los linfocitos TH1:
1. Su diferencia está dirigida sobre todo por la IL-4.
2. Su principal función es activar los macrófagos.
3. Son cruciales en la inmunidad contra los microbios extracelulares.
4. Secretan de una manera importante IL-13.

Respuesta correcta: 2. Su principal función es activar los macrófagos.